Able to be randomized prior to or up to 48 hours after surgery.

The above is a clinical trial inclusion criterion. Annotated with entity spans:
[Non-representable: Able to be randomized prior to or up to 48 hours after surgery.]